wish for pregnancy within next three months

The above is a clinical trial exclusion criterion. Annotated with entity spans:
[Mood: wish for] [Condition: pregnancy] [Temporal: within next three months]